8. Known allergy to mushrooms or related food products.

The above is a clinical trial exclusion criterion. Annotated with entity spans:
8. Known [Condition: allergy to mushrooms] or related food products.